Participan en el tránsito vesicular entre el retículo endoplasmático rugoso (RER) y el aparato de Golgi:
1. Clatrina.
2. Coatómeros (COP).
3. Caveolina.
4. Emerina.

Respuesta correcta: 2. Coatómeros (COP).